Clinical trial exclusion criterion:
Uncontrolled serious active infection.

Annotated entities:
- Condition: "infection"
- Qualifier: "Uncontrolled serious"